Clinical trial exclusion criterion:
8. Evidence of significant airway and/or parenchymal lung disease.

Entity relations:
- Has_qualifier("airway disease", "significant")
- OR("airway disease", "parenchymal lung disease")